presence of ferrous-containing metals within the body (e.g., aneurysm clips, shrapnel/retained particles)

The above is a clinical trial exclusion criterion. Annotated with entity spans:
presence of [Device: ferrous-containing metals] within the body (e.g., [Device: aneurysm clips], [Device: shrapnel]/[Device: retained particles])